Clinical trial exclusion criterion:
Allergy or hypersensitivity to target medication or any of its components

Annotated entities:
- Condition: "Allergy"
- Condition: "hypersensitivity"
- Drug: "target medication"